Normal uterine cavity (as assessed by hysteroscopy or HSG).

The above is a clinical trial inclusion criterion. Annotated with entity spans:
[Value: Normal] [Observation: uterine cavity] (as assessed by [Procedure: hysteroscopy] or [Procedure: HSG]).